Immunocompromised patients:

The above is a clinical trial exclusion criterion. Annotated with entity spans:
[Condition: Immunocompromised] patients: